Clinical trial exclusion criterion:
Pregnant or breast-feeding women.

Annotated entities:
- Condition: "Pregnant"
- Condition: "breast-feeding"
- Person: "women"